Clinical trial exclusion criterion:
Electronic or magnetic implants, such as pacemakers

Entity relations:
- Subsumes("Electronic implants", "pacemakers")
- OR("Electronic implants", "magnetic implants")